缺少表面張力素（surfactant）與下列那一項肺病最相關？
A. 肺炎（pneumonia）
B. 肺氣腫（emphysema）
C. 肺膨脹不全（atelectasis）
D. 支氣管擴張症（bronchiectasis）

正確答案：C. 肺膨脹不全（atelectasis）